Clinical trial exclusion criterion:
Active fungal infection or pulmonary infiltrates (prior treated disease stable for 2 weeks is allowable)

Annotated entities:
- Condition: "fungal infection"
- Condition: "pulmonary infiltrates"
- Condition: "prior treated disease"
- Qualifier: "stable"
- Temporal: "for 2 weeks"
- Negation: "is allowable"